Clinical trial inclusion criterion:
Planned goal TSH suppression 0.1-0.5 mU/L for at least 18 weeks postoperatively

Annotated entities:
- Temporal: "at least 18 weeks postoperatively"
- Reference_point: "postoperatively"
- Condition: "TSH suppression"
- Value: "0.1-0.5 mU/L"